Clinical trial exclusion criterion:
Patients under 18

Annotated entities:
- Person: "under 18"
- Value: "under 18"